¿A qué clase de peso corresponde un Índice de Masa Corporal de 26 y que grado de riesgo conlleva para la salud?:
1. Peso normal y riesgo nulo.
2. Sobrepeso grado I y riesgo nulo.
3. Obesidad grado I y riesgo moderado.
4. Obesidad grado II y riesgo elevado.
5. Obesidad mórbida y riesgo muy elevado.

Respuesta correcta: 2. Sobrepeso grado I y riesgo nulo.